Clinical trial exclusion criterion:
mitral stenosis;

Annotated entities:
- Condition: "mitral stenosis"